singleton pregnancies

The above is a clinical trial inclusion criterion. Annotated with entity spans:
[Condition: singleton pregnancies]